Silent Allosteric Modulation of mGluR5 is a form of treatment for what disease?

Silent allosteric modulation of mGluR5 has promise as a disease-modifying Alzheimer's Disease therapy.